Los tratamientos psicológicos en el trastorno bipolar comparten varios objetivos terapéuticos, entre los cuales NO está:
1. Entrenar a los pacientes en la detección de los síntomas iniciales que preceden al trastorno.
2. Sustituir la necesidad de un tratamiento farmacológico a largo plazo.
3. Enseñar a los pacientes estrategias para afrontar los estímulos estresantes que pueden desencadenar o exacerbar los síntomas.
4. Mejorar la adherencia al tratamiento farmacológico.
5. Proporcionar a los pacientes técnicas para el manejo de los síntomas iniciales evitando así que empeoren.

Respuesta correcta: 2. Sustituir la necesidad de un tratamiento farmacológico a largo plazo.